Clinical trial exclusion criterion:
Professional drivers, risk profession or respiratory failure.

Annotated entities:
- Person: "Professional drivers"
- Person: "risk profession"
- Condition: "respiratory failure"